¿Cuál de las siguientes no es una vitamina liposoluble?:
1. Vitamina A.
2. Vitamina C.
3. Vitamina D.
4. Vitamina E.
5. Vitamina K.

Respuesta correcta: 2. Vitamina C.